乙醇（酒精）與下列何者併用會造成乙醛（acetaldehyde）蓄積，導致噁心、嘔吐及低血壓等身體不適的反應？
A. disulfiram
B. acamprosate
C. naltrexone
D. baclofen

正確答案：A. disulfiram